Clinical trial exclusion criteria:
Known asthmatic or history of allergy towards peanut or milk products
Concurrent participation in another clinical trial
Severe illness warranting hospital referral

Annotated entities:
- Condition: "asthmatic"
- Temporal: "history"
- Condition: "allergy"
- Drug: "peanut"
- Drug: "milk products"
- Observation: "participation in another clinical trial"
- Condition: "illness"
- Qualifier: "Severe"
- Procedure: "hospital referral"
- Mood: "warranting"